<18 years old

The above is a clinical trial exclusion criterion. Annotated with entity spans:
[Value: <18 years] [Person: old]